Clinical trial inclusion criterion:
FEV1 value = 30-80%

Entity relations:
- Has_value("FEV1 value", "= 30-80%")